一位 19 歲女性患者至精神科就醫，主要問題為其自 12 歲起，開始吃東西吃得很少、很慢，非常在意自己的身材和體重。近日，親友們均說其太瘦（162 公分，38 公斤），但患者仍堅持認為自己過胖，還在努力減重。下列何者為其最可能之臨床診斷？
A. 暴食症
B. 厭食症
C. 異食症
D. 營養不良症

正確答案：B. 厭食症